Age = 18 years

The above is a clinical trial inclusion criterion. Annotated with entity spans:
[Person: Age] [Value: = 18 years]